Clinical trial exclusion criterion:
Allergy/intolerance to any of the components of medications used in the treatment.

Annotated entities:
- Condition: "Allergy"
- Condition: "intolerance"
- Drug: "components of medications used in the treatment"